Subjects with unresolved infections

The above is a clinical trial exclusion criterion. Annotated with entity spans:
Subjects with [Qualifier: unresolved] [Condition: infections]